Clinical trial exclusion criterion:
Uncontrolled anxiety, schizophrenia, or other psychiatric disorder that, in the opinion of the investigator, may interfere with study assessments or compliance

Annotated entities:
- Condition: "anxiety"
- Condition: "schizophrenia"
- Condition: "psychiatric disorder"